6. Has a 6-minute walk distance that is ≥150 and ≤500 meters.

The above is a clinical trial inclusion criterion. Annotated with entity spans:
[Parsing_Error: 6.] Has a [Measurement: 6-minute walk distance] that is [Value: ≥150 and ≤500 meters].